Clinical trial exclusion criterion:
Has portal vein invasion at the main portal branch (Vp4), inferior vena cava, or cardiac involvement of HCC based on imaging

Annotated entities:
- Condition: "portal vein invasion"
- Qualifier: "main portal branch (Vp4)"
- Qualifier: "inferior vena cava"
- Condition: "cardiac involvement"
- Condition: "HCC"
- Procedure: "imaging"